Clinical trial exclusion criterion:
medication: antidepressants or H1-receptor antagonists

Annotated entities:
- Drug: "antidepressants"
- Drug: "H1-receptor antagonists"